Clinical trial exclusion criterion:
Creatinine clearance <30 mL/min

Annotated entities:
- Measurement: "Creatinine clearance"
- Value: "<30 mL/min"